Clinical trial exclusion criterion:
Methotrexate used within the previous 6 months

Entity relations:
- Has_temporal("Methotrexate", "within the previous 6 months")